房室結（AV node）最靠近下列何處？
A. 節制帶（moderator band）
B. 下腔靜脈與右心房交界
C. 冠狀竇開口（opening of coronary sinus）
D. 界脊（crista terminalis）

正確答案：C. 冠狀竇開口（opening of coronary sinus）